What is the outcome of COVID-19 patients treated with tocilizumab?

Preliminary clinical results have indicated that tocilizumab can improve the outcomes of patients with severe or critical COVID-19 while maintaining a good safety profile.